Clinical trial exclusion criterion:
Hormone Replacement Therapy or oral contraceptive usage

Annotated entities:
- Procedure: "Hormone Replacement Therapy"
- Drug: "oral contraceptive"